Clinical trial exclusion criterion:
Females who are pregnant, become to be pregnant or breastfeeding or males whose partners are pregnant, become to be pregnant or breastfeeding.

Annotated entities:
- Condition: "pregnant"
- Person: "Females"
- Observation: "become"
- Condition: "pregnant"
- Observation: "breastfeeding"
- Non-query-able: "partners are pregnant, become to be pregnant or breastfeeding"
- Person: "males"